家族型高膽固醇血症有可能是因為低密度脂蛋白受體基因突變所引起。一對夫妻有一位 5 歲的小孩，身上出現黃色瘤（xanthoma）而就診。抽血檢查後發現其膽固醇濃度非常的高，大於 1000 mg/dL。 如果醫師進行家族分析，很可能會有下列那一項發現？
A. 父親的膽固醇濃度大於 1000 mg/dL，母親正常
B. 母親的膽固醇濃度大於 1000 mg/dL，父親正常
C. 父母親的膽固醇濃度都介於 300～400 mg/dL 之間
D. 父母親的膽固醇濃度都正常

正確答案：C. 父母親的膽固醇濃度都介於 300～400 mg/dL 之間